In which chromosome are transgenes inserted in the case of the LiPS-A3S line?

The LiPS-A3S line of human pluripotent stem cells is inserted via transgenesis from chromosome 15.